Clinical trial inclusion criterion:
age 35-75 years;

Entity relations:
- Has_value("age", "35-75 years")